55歲男性病患因肝癌而進行上腹部剖腹手術，下列有關此種急性手術疼痛的敘述，何者錯誤？
A. 急性手術疼痛本身不會引起胃腸道的壓力反應
B. 上腹部剖腹手術是屬於中重度疼痛
C. 急性手術疼痛會引起心肺功能異常
D. 急性手術疼痛會引起白血球上升

正確答案：A. 急性手術疼痛本身不會引起胃腸道的壓力反應